14. Mental impairment that may compromise compliance with the requirements of the study.

The above is a clinical trial exclusion criterion. Annotated with entity spans:
[Parsing_Error: 14.] [Context_Error: Mental impairment that may compromise compliance with the requirements of the study.]